With moderate/good ECOG health rating (PS): 0-1 score.

The above is a clinical trial inclusion criterion. Annotated with entity spans:
With [Value: moderate/good] [Measurement: ECOG health rating (PS)]: [Value: 0-1 score].